Clinical trial exclusion criterion:
Liver cirrhosis

Annotated entities:
- Condition: "Liver cirrhosis"